Has previously received Dapsone therapy.

The above is a clinical trial exclusion criterion. Annotated with entity spans:
Has previously received [Drug: Dapsone] therapy.